那些空氣污染物會造成酸雨效應？①一氧化碳 ②臭氧 ③硫氧化物 ④氮氧化物
A. 僅①②
B. ①②③
C. 僅③④
D. ②③④

正確答案：C. 僅③④